Clinical trial exclusion criterion:
Current use of CYP1A2 Inhibitors

Annotated entities:
- Drug: "CYP1A2 Inhibitors"